Clinical trial exclusion criterion:
Renal dysfunction (CrCl < 30ml/min).

Annotated entities:
- Condition: "Renal dysfunction"
- Measurement: "CrCl"
- Value: "< 30ml/min"